La amantadina es un fármaco que puede ser utilizado como:
1. Antiviral y antiparkinsoniano.
2. Antipsicótico y antiemético.
3. Ansiolítico y antifúngico.
4. Antifúngico y antiparkinsoniano.
5. Antifúngico y antimigrañoso.

Respuesta correcta: 1. Antiviral y antiparkinsoniano.